Presence of any infertility factor other than anovulation/oligoovulation.

The above is a clinical trial exclusion criterion. Annotated with entity spans:
Presence of any [Condition: infertility factor] [Negation: other than] [Condition: anovulation]/[Condition: oligoovulation].